Clinical trial exclusion criterion:
previous diagnosis of active neoplastic disease

Annotated entities:
- Condition: "neoplastic disease"